Clinical trial exclusion criterion:
Chronic HCV Infection with Genotype 2 or 3

Entity relations:
- Has_qualifier("Chronic HCV Infection", "Genotype 2")
- OR("Genotype 2", "Genotype 3")